50 歲男性患者，身體檢查發現鞏膜變黃，但小便顏色並無異常，下列的診斷何者可能性最小？
A. 溶血性貧血
B. Gilbert 症候群
C. 總膽管結石
D. Crigler-Najjar 症候群

正確答案：C. 總膽管結石